Clinical trial exclusion criterion:
indications to dual antiplatelet therapy other than atrial fibrillation or left atrial appendage occlusion at the time of enrollment or predicted appearance of such indications within the duration of the trial (eg. coronary artery disease)

Entity relations:
- AND("indications", "dual antiplatelet therapy")
- Has_negation("atrial fibrillation", "other than")
- AND("indications", "atrial fibrillation")
- Has_temporal("indications", "at the time of enrollment")
- Subsumes("predicted appearance", "coronary artery disease")
- Subsumes("within the duration of the trial", "coronary artery disease")
- OR("atrial fibrillation", "left atrial appendage occlusion")
- OR("at the time of enrollment", "predicted appearance")